Clinical trial exclusion criterion:
Patient has a current malignancy or a history of malignancy (within the past 5 years), except hepatocellular carcinoma within UCSF Criteria and basal or non-metastatic squamous cell carcinoma of skin that has been treated successfully.

Annotated entities:
- Condition: "malignancy"
- Condition: "history of malignancy"
- Temporal: "within the past 5 years"
- Condition: "hepatocellular carcinoma"
- Negation: "except"
- Measurement: "UCSF Criteria"
- Condition: "basal cell carcinoma of skin"
- Condition: "squamous cell carcinoma of skin"
- Qualifier: "non-metastatic"
- Mood: "treated successfully"